一般而言，支配肢體伸張（extension of limb）的運動神經元位於脊髓前角的：
A. 腹內側區（ventromedial division）
B. 腹外側區（ventrolateral division）
C. 背內側區（dorsomedial division）
D. 背外側區（dorsolateral division）

正確答案：B. 腹外側區（ventrolateral division）